以下有關快速週期（rapid cycling）之雙極性疾患（bipolar disorder）之敘述，何者正確？
A. 依據美國精神醫學會所制定之第四版診斷與統計手冊（DSM IV）之定義為半年內至少有 3 次發作
B. 常見於女性
C. 此症有明顯家族遺傳之傾向
D. 服用苯二氮平（benzodiazepines）會誘發產生此症

正確答案：B. 常見於女性